Lactating females.

The above is a clinical trial exclusion criterion. Annotated with entity spans:
[Condition: Lactating] [Person: females].